Clinical trial exclusion criterion:
Hospitalization for major surgery including but not limited to abdominal, thoracic, or cardiovascular surgery within the past 3 months prior to screening, or for a clinically significant non-surgical illness, based on Investigator judgment, within the past 3 months.

Annotated entities:
- Procedure: "Hospitalization"
- Procedure: "surgery"
- Qualifier: "major"
- Subjective_judgement: "major"
- Undefined_semantics: "major"
- Procedure: "cardiovascular surgery"
- Procedure: "thoracic surgery"
- Procedure: "abdominal surgery"
- Temporal: "within the past 3 months prior to screening"
- Reference_point: "screening"
- Condition: "non-surgical illness"
- Qualifier: "clinically significant"
- Subjective_judgement: "clinically significant"
- Undefined_semantics: "clinically significant"
- Subjective_judgement: "based on Investigator judgment"
- Temporal: "within the past 3 months"